Clinical trial inclusion criterion:
Alanine transaminase (ALT) less than 3 x ULN

Annotated entities:
- Measurement: "Alanine transaminase (ALT)"
- Value: "less than 3 x ULN"